某一世代研究探討吸菸與某疾病的關係，各追蹤吸菸與非吸菸者 3000 名，研究期間發現吸菸者有 60 名罹患該疾病，非吸菸者有 15 名。該疾病有多少比例可歸因吸菸所引起的？
A. 1.5%
B. 2%
C. 45%
D. 75%

正確答案：D. 75%